新型隱球菌（Cryptococcus neoformans）以何種孢子進行繁殖？
A. 孢子囊孢子
B. 厚膜孢子
C. 分生孢子
D. 芽生孢子

正確答案：D. 芽生孢子